Clinical trial inclusion criterion:
measurable lesion by CT or other techniques according to RECIST

Annotated entities:
- Procedure: "CT"
- Condition: "measurable lesion"